Cardiac arrest

The above is a clinical trial exclusion criterion. Annotated with entity spans:
[Condition: Cardiac arrest]